Females of childbearing potential must agree to be abstinent or else use any two of the following medically acceptable forms of contraception from the Screening Period through the Final Study Visit: hormonal, condom with spermicidal jelly, diaphragm or cervical cap with spermicidal jelly, or IUD. Hormonal contraception must have started at least 3 months prior to screening. A female whose male partner has had a vasectomy must agree to use one additional form of medically acceptable contraception. Subjects must agree to practice the above birth control methods for 30 days from the final visit as a safety precaution.

The above is a clinical trial inclusion criterion. Annotated with entity spans:
[Non-query-able: Females of childbearing potential must agree to be abstinent or else use any two of the following medically acceptable forms of contraception from the Screening Period through the Final Study Visit: hormonal, condom with spermicidal jelly, diaphragm or cervical cap with spermicidal jelly, or IUD.] [Procedure: Hormonal contraception] must have started [Temporal: at least 3 months prior to screening]. [Post-eligibility: A female whose male partner has had a vasectomy must agree to use one additional form of medically acceptable contraception.] [Post-eligibility: Subjects must agree to practice the above birth control methods for 30 days from the final visit as a safety precaution.]